Bimekizumab is used for treatment of which disease?

Bimekizumab is used for psoriasis.